Agree to participate this study

The above is a clinical trial inclusion criterion. Annotated with entity spans:
[Post-eligibility: Agree to participate this study]